Clinical trial inclusion criteria:
Subjects admitted to the hospital with acute or chronic medical illnesses or for elective and emergency surgical illness or trauma
Known history of Type 2 diabetes mellitus for >3 months
Treated with either diet alone, any combination of oral antidiabetic agents, non-insulin injectables or insulin therapy
Blood glucose levels between >140 mg and <400 mg/dL without laboratory evidence of diabetic ketoacidosis

Annotated entities:
- Observation: "admitted to the hospital"
- Condition: "medical illnesses"
- Qualifier: "chronic"
- Qualifier: "acute"
- Condition: "surgical illness"
- Condition: "trauma"
- Qualifier: "emergency"
- Qualifier: "elective"
- Grammar_Error: "and"
- Condition: "Type 2 diabetes mellitus"
- Value: ">3 months"
- Procedure: "diet"
- Drug: "oral antidiabetic agents"
- Drug: "insulin"
- Drug: "non-insulin injectables therapy"
- Measurement: "Blood glucose levels"
- Value: ">140 mg and <400 mg/dL"
- Negation: "without"
- Qualifier: "laboratory evidence"
- Condition: "diabetic ketoacidosis"